Clinical trial inclusion criterion:
Must have received front line chemotherapy. No upper limit for the number of prior therapies

Entity relations:
- Has_qualifier("chemotherapy", "front line")